Clinical trial inclusion criterion:
willingness to wear the insulin pump

Annotated entities:
- Mood: "willingness"
- Procedure: "wear the insulin pump"
- Device: "insulin pump"